依Goodsall's rule，肛門瘻管外口位於8點鐘方向，則其內口應在幾點鐘方向？
A. 3點
B. 6點
C. 9點
D. 12點

正確答案：B. 6點